Clinical trial inclusion criterion:
Written informed consent from the patient or family representative.

Annotated entities:
- Informed_consent: "Written informed consent from the patient or family representative."